Clinical trial exclusion criterion:
Significant change in diet or level of physical activity within 1 month before dosing or change in weight of more than 5 kg within 3 months before Screening

Entity relations:
- Has_index("within 1 month before dosing", "dosing")
- Has_qualifier("change in diet", "Significant")
- Has_temporal("change in diet", "within 1 month before dosing")
- Has_value("change in weight", "more than 5 kg")
- Has_index("within 3 months before Screening", "Screening")
- Has_temporal("change in weight", "within 3 months before Screening")
- Has_qualifier("change in level of physical activity", "Significant")
- Has_temporal("change in level of physical activity", "within 1 month before dosing")
- OR("change in diet", "change in weight")
- OR("change in level of physical activity", "change in weight")